下列藥物何者不經由腎臟排除？
A. Cephazolin
B. Tobramycin
C. Chloramphenicol
D. Imipenem

正確答案：C. Chloramphenicol